Clinical trial exclusion criterion:
Myelodysplastic syndrome or hematological malignancy

Entity relations:
- OR("Myelodysplastic syndrome", "hematological malignancy")